Clinical trial exclusion criterion:
MDRD(Modification of Diet in Renal Disease) Estimated Glomerular filtration rate less than 60 mL / m2

Annotated entities:
- Qualifier: "MDRD(Modification of Diet in Renal Disease)"
- Measurement: "Estimated Glomerular filtration rate"
- Value: "less than 60 mL / m2"